Which company produces the HercepTest?

DAKO is the company producing the companion diagnostic HercepTest.